一位28歲女性因運動性呼吸困難大約半年至心臟科門診求診。病患否認有胸悶，端坐呼吸或陣發性夜間呼吸 困難情形，大約在1週前突發性心悸不適狀況。身體診察發現有隨呼吸固定第二心音分裂（fixed splitting S2）以及輕微收縮期心雜音。心電圖顯示心軸右偏（right axis deviation）及V1 rSR'。胸部X光顯示右心房及肺動脈擴大。該病患最可能診斷為何？
A. 心房中膈缺損（atrial septal defect）
B. 心室中膈缺損（ventricular septal defect）
C. 主動脈縮窄（coarctation of the aorta）
D. 法洛氏四合症（tetralogy of Fallot）

正確答案：A. 心房中膈缺損（atrial septal defect）